Any disorder which, in the opinion of the investigator, might jeopardise subject's safety or compliance with the protocol.

The above is a clinical trial exclusion criterion. Annotated with entity spans:
[Post-eligibility: Any disorder which, in the opinion of the investigator, might jeopardise subject's safety or compliance with the protocol.]